下列何種疾病是導致成人自發性甲狀腺機能低下（spontaneous hypothyroidism）最常見的原因？
A. Plummer's disease
B. 格雷夫氏甲狀腺機能亢進（Graves' disease）
C. 甲狀腺癌
D. 橋本氏甲狀腺炎（Hashimoto's thyroiditis）

正確答案：D. 橋本氏甲狀腺炎（Hashimoto's thyroiditis）